Clinical trial inclusion criterion:
adult female partner

Annotated entities:
- Person: "adult"
- Person: "female"
- Observation: "female partner"